Clinical trial inclusion criterion:
South Australian secondary school students in years 10, 11, and 12 in 2017

Entity relations:
- Has_qualifier("secondary school students", "years 10")
- Has_temporal("secondary school students", "in 2017")
- OR("years 10", "years 12", "years 11")